Clinical trial exclusion criterion:
Patients with a history of gynecologic malignancy

Entity relations:
- Has_temporal("gynecologic malignancy", "history")